下列何者不屬於妊娠前糖尿病之胎兒合併症？
A. congenital malformation
B. Abortion
C. fetal death
D. cerebral hemorrhage

正確答案：D. cerebral hemorrhage